Clinical trial exclusion criterion:
Subject suffers from any condition, such as swallowing problems, that precludes compliance with study and/or device instructions.

Entity relations:
- Subsumes("condition", "swallowing problems")
- OR("compliance with study", "compliance with device instructions")